ECOG performance status 2.

The above is a clinical trial inclusion criterion. Annotated with entity spans:
[Measurement: ECOG performance status] [Value: 2].